¿Cómo se llama la parte del antígeno que es reconocida por el anticuerpo?:
1. Ectópico.
2. Epímero.
3. Epíteto.
4. Epítopo.
5. Endógeno.

Respuesta correcta: 4. Epítopo.